張先生，55 歲，已知有B型肝炎相關之肝硬化，目前AST 150 U/L，ALT 120 U/L，膽紅素 2.5 mg/dL， HBV DNA值 5×105 IU/mL，血小板 50×103/mm3。下列敘述何者錯誤？
A. 可接受干擾素之治療
B. 可接受口服抗病毒藥物之治療
C. 治療期間，仍應接受肝癌篩檢
D. 若治療反應不佳，可考慮作肝臟移植之評估

正確答案：A. 可接受干擾素之治療